Clinical trial exclusion criterion:
COPD exacerbation, very severe COPD with hypoxemia at low altitude (FEV1/FVC <0.7, FEV1 <40% predicted, oxygen saturation on room air <92% at 750 m).

Annotated entities:
- Condition: "COPD exacerbation"
- Condition: "COPD"
- Qualifier: "very severe"
- Condition: "hypoxemia"
- Qualifier: "low altitude"
- Measurement: "FEV1/FVC"
- Value: "<0.7"
- Measurement: "FEV1"
- Value: "<40% predicted"
- Measurement: "oxygen saturation"
- Qualifier: "room air"
- Value: "<92% at 750 m"